Evidence of recovering finger/thumb extension at 4-6 months

The above is a clinical trial exclusion criterion. Annotated with entity spans:
Evidence of [Observation: recovering] [Qualifier: finger]/[Qualifier: thumb] extension [Temporal: at 4-6 months]